Clinical trial exclusion criterion:
Total cholesterol >280 mg/dL

Annotated entities:
- Measurement: "Total cholesterol"
- Value: ">280 mg/dL"